Patients considered to be at risk of bradycardic events (e.g., known sick sinus syndrome or second or third degree atrioventricular [AV)] block) unless already treated with a permanent pacemaker

The above is a clinical trial exclusion criterion. Annotated with entity spans:
Patients considered to be [Mood: at risk of] [Condition: bradycardic events] (e.g., known [Condition: sick sinus syndrome] or [Condition: second] or [Condition: third degree atrioventricular [AV)] block]) [Negation: unless] already treated with a [Device: permanent pacemaker]